Clinical trial exclusion criteria:
Patients posing a serious suicidal risk and/or violence as judged by the investigator;
Delirium
Dementia
Amnestic and other cognitive disorder;
Patients with a history of hypothyroidism unless taking a stable dose of thyroid medication and asymptomatic or euthyroid for 6 months;
Patients who meet DSM-IV-TR criteria for any significant current substance abuse;
hepatic insufficiency (three times the upper limit of normal (ULN) for aspartate aminotransferase (AST) and/or alanine aminotransferase (ALT)); liver transplant recipient; cirrhosis of the liver;
malignancy (except basal cell carcinoma) and/or chemotherapy within 1 year prior to screening; malignancy more than 1 year prior to screening must have been local and without metastasis and/or recurrence, and if treated with chemotherapy, without nervous system complications;
significant unstable medical condition or life threatening disease with anticipated survival of less than 6 months;
need for therapies that may obscure the results of treatment and/or of the study
Participation in another clinical trial within 30 days of the screening visit;
Anticipated inability to attend scheduled study visits;
Patients who in the judgment of the Investigator may be unreliable or uncooperative with the evaluation procedure outlined in this protocol;
Patients with a history of prior pharmacogenomic testing;
Any change in psychotropic medication (including change in dosage) between screening and baseline;
Patients who are known to be pregnant or lactating;
Patients with a history of gastric bypass surgery.

Annotated entities:
- Observation: "suicidal risk"
- Observation: "violence"
- Condition: "Delirium"
- Condition: "Dementia"
- Condition: "cognitive disorder"
- Condition: "Amnestic disorder"
- Condition: "hypothyroidism"
- Negation: "unless"
- Drug: "thyroid medication"
- Condition: "substance abuse"
- Measurement: "DSM-IV-TR"
- Condition: "hepatic insufficiency"
- Measurement: "aspartate aminotransferase"
- Measurement: "AST"
- Measurement: "alanine aminotransferase"
- Measurement: "ALT"
- Value: "three times the upper limit of normal"
- Procedure: "liver transplant"
- Condition: "cirrhosis of the liver"
- Condition: "malignancy"
- Negation: "except"
- Condition: "basal cell carcinoma"
- Procedure: "chemotherapy"
- Temporal: "within 1 year prior to screening"
- Reference_point: "screening"
- Condition: "malignancy"
- Temporal: "more than 1 year"
- Qualifier: "local"
- Negation: "without"
- Condition: "metastasis"
- Condition: "recurrence"
- Condition: "medical condition"
- Qualifier: "unstable"
- Condition: "life threatening disease"
- Observation: "anticipated survival"
- Value: "less than 6 months"
- Non-query-able: "need for therapies that may obscure the results of treatment and/or of the study"
- Competing_trial: "Participation in another clinical trial within 30 days of the screening visit"
- Post-eligibility: "Anticipated inability to attend scheduled study visits"
- Non-query-able: "Patients who in the judgment of the Investigator may be unreliable or uncooperative with the evaluation procedure outlined in this protocol"
- Competing_trial: "Patients with a history of prior pharmacogenomic testing"
- Procedure: "psychotropic medication"
- Pregnancy_considerations: "Patients who are known to be pregnant or lactating"
- Procedure: "gastric bypass surgery"